有關股疝氣（femoral hernia）之敘述，下列何者正確？
A. 通常是雙側
B. 是婦女最常發生的疝氣類型
C. 左側較常發生
D. 常伴隨腸絞扼（strangulation）

正確答案：D. 常伴隨腸絞扼（strangulation）